Clinical trial inclusion criterion:
eligible based on WALI screening tool

Entity relations:
- Has_value("WALI screening tool", "eligible")